¿Qué pruebas del WISC IV forman parte del índice de razonamiento perceptivo?:
1. Búsqueda de símbolos, cubos y dígitos.
2. Matrices, cubos y conceptos.
3. Búsqueda de símbolos, letras y números, y conceptos.
4. Matrices, claves y conceptos.
5. Cubos, letras y números, y conceptos.

Respuesta correcta: 2. Matrices, cubos y conceptos.